History of cancer (within the last year)

The above is a clinical trial exclusion criterion. Annotated with entity spans:
History of [Condition: cancer] (within the [Temporal: last year])